Una proteína conjugada es:
1. Una proteína que contiene componentes químicos diferentes a los aminoácidos asociados permanentemente.
2. Una proteína que contiene aminoácidos con cadenas laterales con enlaces conjugados.
3. Una proteína que contiene componentes químicos que la hacen insoluble.
4. Una proteína incorrectamente plegada.
5. Una proteína desnaturalizada e inactivada.

Respuesta correcta: 1. Una proteína que contiene componentes químicos diferentes a los aminoácidos asociados permanentemente.